La zona de rechazo de la hipótesis nula se llama:
1. Región β o de rechazo.
2. Región crítica o de rechazo.
3. Región de confianza o de rechazo.
4. Región 1-α o de rechazo.

Respuesta correcta: 2. Región crítica o de rechazo.